Clinical trial inclusion criterion:
Male or non-pregnant female between the ages of 18-65

Annotated entities:
- Person: "Male"
- Person: "female"
- Qualifier: "pregnant"
- Negation: "non"
- Person: "ages"
- Value: "18-65"